Clinical trial inclusion criterion:
Diagnosed with an infection related stone.

Entity relations:
- Has_qualifier("stone", "infection related")